Clinical trial exclusion criterion:
1. Justification: Any metal around the head is a contraindication for both MRI and TMS, as both methods involve exposure to a relatively strong magnetic field.

Annotated entities:
- Parsing_Error: "1."
- Non-representable: "Justification: Any metal around the head is a contraindication for both MRI and TMS, as both methods involve exposure to a relatively strong magnetic field."